Clinical trial exclusion criterion:
History of allergic reaction to compounds of similar chemical or biologic composition to hCG

Entity relations:
- multi("compounds of similar chemical or biologic composition to hCG", "hCG")
- AND("allergic reaction", "compounds of similar chemical or biologic composition to hCG")
- Has_temporal("allergic reaction", "History")